Clinical trial inclusion criterion:
Have a documented diagnosis of persistent asthma, as defined by the National Institutes of Health for at least 3 months prior to the Screening Visit.

Entity relations:
- Has_qualifier("persistent asthma", "as defined by the National Institutes of Health")
- Has_index("at least 3 months prior to the Screening Visit", "Screening Visit")